Clinical trial exclusion criterion:
Clinically significant hallucinations for which either 1) the frequency of hallucinations as assessed by the NPI is 'Very frequently', or 2) the frequency of hallucinations as assessed by the NPI is 'Frequently' AND the severity of the hallucinations as assessed by the NPI is 'Moderate', or 'Marked'

Entity relations:
- Has_qualifier("hallucinations", "Clinically significant")
- AND("frequency of hallucinations", "hallucinations")
- Has_value("NPI", "Very frequently")
- AND("frequency of hallucinations", "hallucinations")
- AND("severity of the hallucinations", "hallucinations")
- Has_value("NPI", "Moderate")
- AND("severity of the hallucinations", "NPI")
- Has_value("NPI", "Frequently")
- AND("frequency of hallucinations", "NPI")
- AND("frequency of hallucinations", "NPI")
- Has_multiplier("hallucinations", "frequency of hallucinations")
- Has_multiplier("hallucinations", "frequency of hallucinations")
- OR("Moderate", "Marked")
- OR("frequency of hallucinations", "severity of the hallucinations")